Clinical trial inclusion criterion:
13. Serum aspartate transaminase (AST) and/or alanine transaminase (ALT) ≤2.5 × ULN

Entity relations:
- Has_value("alanine transaminase (ALT)", "≤2.5 × ULN")
- Has_value("Serum aspartate transaminase (AST)", "≤2.5 × ULN")
- OR("Serum aspartate transaminase (AST)", "alanine transaminase (ALT)")